Subject has scoliosis of greater than ten (10) degrees (both angular and rotational).

The above is a clinical trial exclusion criterion. Annotated with entity spans:
Subject has [Condition: scoliosis] of [Qualifier: greater than ten (10) degrees] (both [Qualifier: angular] and [Qualifier: rotational]).